Clinical trial exclusion criterion:
Acute or chronic disease

Entity relations:
- OR("Acute disease", "chronic disease")